Clinical trial exclusion criteria:
presence of subacute or chronic DVT more than 21 days in duration, inability to lie in the prone position required for intervention, terminal systemic disease requiring palliative treatment, active bleeding (from a gastric/duodenal ulcer or the cerebrovascular system), a haemorrhagic stroke within the previous year, an impaired bleeding-clotting profile, and any haemophilic disorder, or pregnancy.

Annotated entities:
- Qualifier: "subacute"
- Qualifier: "chronic"
- Condition: "DVT"
- Multiplier: "more than 21 days in duration"
- Condition: "inability to lie in the prone position"
- Non-representable: "required for intervention"
- Condition: "terminal systemic disease"
- Procedure: "palliative treatment"
- Mood: "requiring"
- Qualifier: "active"
- Condition: "bleeding"
- Condition: "duodenal ulcer"
- Condition: "gastric ulcer"
- Qualifier: "cerebrovascular system"
- Condition: "haemorrhagic stroke"
- Temporal: "within the previous year"
- Condition: "impaired bleeding-clotting profile"
- Condition: "haemophilic disorder"
- Condition: "pregnancy"